Absence of documentation in the medical record of clinical remission for the last 6 months

The above is a clinical trial exclusion criterion. Annotated with entity spans:
[Negation: Absence of] documentation in the medical record of [Condition: clinical remission] [Temporal: for the last 6 months]